Which gene is responsible for proper speech development?

The Key Regulator for Language and Speech Development, FOXP2, is a Novel Substrate for SUMOylation. The data also point to a role for differential parent-of-origin expression of FOXP2 in human speech development.